HAND diagnosis (ANI, MND, or HAD) within 60 days prior to study entry. HAND is defined as at least mild impairment on neurocognitive testing (more than one standard deviation below appropriate normative data in two domains of functioning) and no severely confounding factors.

The above is a clinical trial inclusion criterion. Annotated with entity spans:
[Condition: HAND] diagnosis ([Condition: ANI], [Condition: MND], or [Condition: HAD]) [Temporal: within 60 days prior to study entry]. HAND is defined as [Qualifier: at least mild] [Value: impairment] on [Measurement: neurocognitive testing] ([Value: more than one standard deviation below appropriate normative data] [Multiplier: in two domains of functioning]) and [Negation: no] [Condition: severely confounding factors].